Clinical trial exclusion criterion:
Any history of substance abuse (other than tobacco)

Annotated entities:
- Condition: "substance abuse"
- Observation: "tobacco"
- Negation: "other"